Clinical trial exclusion criterion:
Denied consent

Annotated entities:
- Informed_consent: "Denied consent"